Clinical trial inclusion criterion:
Non-smoking

Annotated entities:
- Condition: "smoking"
- Negation: "Non"